正常情況下，人類每天由迴腸排入盲腸之液體量約多少？
A. 500~1000 毫升
B. 1000~1500 毫升
C. 1500~2000 毫升
D. 2000~3000 毫升

正確答案：B. 1000~1500 毫升